Other significant condition that in the Investigator's opinion would exclude the subject from the trial.

The above is a clinical trial exclusion criterion. Annotated with entity spans:
[Post-eligibility: Other significant condition that in the Investigator's opinion would exclude the subject from the trial].